What disease is treated with Laparoscopic Heller Myotomy (LHM)?

To compare the outcome of per oral endoscopic myotomy (POEM) and laparoscopic Heller myotomy (LHM) for the treatment of esophageal achalasia